Clinical trial exclusion criterion:
CMI > 30

Entity relations:
- Has_value("CMI", "> 3")